Clinical trial inclusion criterion:
serum alanine transaminase (ALT) ≤ 2.5 x ULN (in case of liver metastases < 5 x ULN)

Annotated entities:
- Measurement: "serum alanine transaminase (ALT)"
- Value: "≤ 2.5 x ULN"
- Condition: "liver metastases"
- Value: "< 5 x ULN"